History of, or clinical evidence of, a condition which, in the opinion of the investigator, could confound the results of the study or put the subject at undue risk

The above is a clinical trial exclusion criterion. Annotated with entity spans:
[Temporal: History] of, or [Observation: clinical evidence] of, a condition which, in the opinion of the investigator, [Condition: could confound the results of the study or put the subject at undue risk]